Clinical trial exclusion criteria:
Bone age reading more than 14.0 years
Follicle stimulating hormone > 20 IU/L

Annotated entities:
- Measurement: "Bone age"
- Value: "more than 14.0 years"
- Measurement: "Follicle stimulating hormone"
- Value: "> 20 IU/L"